一位 49 歲女性病患因上腹以及左上腹區域疼痛約 2 至 3 天而求診，急診室的檢查結果顯示 Hb  10.4 g/dL，WBC 分類 N/L 79.9%/14.5%，glucose 115 mg/dL，BUN 13 mg/dL，creatinine 0.9 mg/dL，CRP  8 mg/L，lipase 173 U/L，amylase 67 U/L，triglyceride 1634 mg/dL。下列何項檢查最可能確定診斷？
A. 上消化道內視鏡（UGI endoscopy）
B. 腹部電腦斷層檢查（abdominal CT scan）
C. 大腸鏡檢查（colonoscopy）
D. 腫瘤標記檢查（tumor markers）

正確答案：B. 腹部電腦斷層檢查（abdominal CT scan）